一位 2 歲女童，發燒 2 天後就診，發現有右側急性中耳炎，給與 amoxicillin 90 mg/kg/day tid 治療 3 天之後，仍然持續發燒，於是以 90 mg amoxicillin/kg/day tid 之劑量使用 amoxicillin-clavulanic acid，體溫隨即回復正常。下列四種細菌之中，那一種最符合該女童中耳炎之治療反應？
A. Staphylococcus aureus
B. Streptococcus pneumoniae
C. Haemophilus influenzae
D. Group A streptococcus

正確答案：C. Haemophilus influenzae